Clinical trial inclusion criterion:
Elevated liver enzymes at baseline blood test

Entity relations:
- Has_temporal("blood test", "baseline")
- Has_value("liver enzymes", "Elevated")
- AND("liver enzymes", "blood test")